Clinical trial exclusion criteria:
adequately controlled with appropriate therapy or would compromise the patient's ability to tolerate this therapy; 2. Treatment with any systemic anticancer therapy ≤ 3 weeks prior to cycle 1 day 1 3. Uncontrolled active infection (Hepatitis B and C infection are NOT exclusion criteria) and/or known HIV infection; 4. Renal failure requiring haemodialysis or peritoneal dialysis; 5. Patients who are pregnant or breast-feeding; 6. Patients with significantly diseased or obstructed gastrointestinal tract, malabsorption, uncontrolled vomiting or diarrhea resulting in inability to swallow oral medications; 7. Presence of symptomatic CNS metastasis 8. Unresolved toxicity from previous anti-cancer therapy or incomplete recovery from surgery, in particular oxaliplatin-induced peripheral neuropathy > grade 1.
9. Any of the following within the 12 months prior to study drug administration: myocardial infarction, severe/unstable angina, coronary/peripheral artery bypass graft, symptomatic congestive heart failure, cerebrovascular accident or transient ischemic attack, pulmonary embolism, deep vein thrombosis, or other thromboembolic event.

Annotated entities:
- Subjective_judgement: "adequately controlled with appropriate therapy or would compromise the patient's ability to tolerate this therapy; 2."
- Non-query-able: "adequately controlled with appropriate therapy or would compromise the patient's ability to tolerate this therapy; 2."
- Procedure: "systemic anticancer therapy"
- Temporal: "≤ 3 weeks prior to cycle 1"
- Reference_point: "cycle 1"
- Condition: "Hepatitis B infection"
- Condition: "Hepatitis C infection"
- Negation: "NOT"
- Condition: "infection"
- Temporal: "active"
- Qualifier: "Uncontrolled"
- Condition: "HIV infection"
- Condition: "Renal failure"
- Procedure: "haemodialysis"
- Procedure: "peritoneal dialysis"
- Condition: "pregnant"
- Condition: "breast-feeding"
- Parsing_Error: "6."
- Parsing_Error: "5."
- Condition: "obstructed gastrointestinal tract"
- Condition: "diseased gastrointestinal tract"
- Undefined_semantics: "diseased gastrointestinal tract"
- Qualifier: "significantly"
- Subjective_judgement: "significantly"
- Non-query-able: "significantly"
- Condition: "malabsorption"
- Condition: "vomiting"
- Qualifier: "uncontrolled"
- Condition: "diarrhea"
- Condition: "inability to swallow oral medications"
- Parsing_Error: "7."
- Condition: "CNS metastasis"
- Parsing_Error: "8."
- Qualifier: "symptomatic"
- Procedure: "anti-cancer therapy"
- Temporal: "previous"
- Procedure: "surgery"
- Condition: "incomplete recovery"
- Drug: "oxaliplatin"
- Qualifier: "oxaliplatin-induced"
- Condition: "peripheral neuropathy"
- Condition: "Unresolved toxicity"
- Parsing_Error: "9."
- Temporal: "within the 12 months prior to study drug administration"
- Reference_point: "study drug administration"
- Condition: "myocardial infarction"
- Condition: "unstable angina"
- Condition: "severe angina"
- Condition: "coronary artery bypass graft"
- Condition: "peripheral artery bypass graft"
- Condition: "symptomatic congestive heart failure"
- Condition: "cerebrovascular accident"
- Condition: "transient ischemic attack"
- Condition: "pulmonary embolism"
- Condition: "deep vein thrombosis"
- Condition: "other thromboembolic event"